對於肺炎黴漿菌（Mycoplasma pneumoniae）感染的描述，下列何者錯誤？
A. 是學齡兒童社區性肺炎的常見病原
B. 肺外病徵包括腦炎、關節炎和皮疹
C. 潛伏期2～3週，家庭內傳染性高
D. 正確診斷主要靠痰液和血液培養

正確答案：D. 正確診斷主要靠痰液和血液培養